我國目前的全民健康保險，是以何者為主要財源？
A. 一般賦稅
B. 彩券收入
C. 外匯存底
D. 保險費

正確答案：D. 保險費